在麻醉中，下列何種方法可持續且有效的測知病人是否缺氧？
A. 監測吸入氧濃度
B. 觀察病人皮膚顏色
C. 脈衝式血氧儀（pulse oxymetry）
D. 動脈血氧氣體分析

正確答案：C. 脈衝式血氧儀（pulse oxymetry）